Clinical trial exclusion criterion:
History of thromboembolic event (e.g., PE or DVT)

Annotated entities:
- Condition: "thromboembolic event"
- Condition: "PE"
- Condition: "DVT"